patients = 70 years of age, undergoing a noncardiac surgical procedure under general anesthesia, with an anticipated duration of postoperative admission of at least 2 days.

The above is a clinical trial inclusion criterion. Annotated with entity spans:
patients [Value: = 70 years] of [Person: age], undergoing a [Procedure: noncardiac surgical procedure] under [Procedure: general anesthesia], with an [Mood: anticipated] [Measurement: duration of postoperative admission] of [Value: at least 2 days].